Gallbladder's wall >3mm, atrophied gallbladder,gallstone obstruct the Hartmann's pouch.

The above is a clinical trial exclusion criterion. Annotated with entity spans:
[Measurement: Gallbladder's wall] [Value: >3mm], [Condition: atrophied gallbladder],[Condition: gallstone obstruct] the [Qualifier: Hartmann's pouch].